Clinical trial exclusion criterion:
Use of anticoagulation therapy

Entity relations:
- Subsumes("anticoagulation therapy", "anticoagulation")